Cardiovascular disease such as arrythmia, ischaemic heart disease.

The above is a clinical trial exclusion criterion. Annotated with entity spans:
[Condition: Cardiovascular disease] such as [Condition: arrythmia], [Condition: ischaemic heart disease].